De los siguientes contaminantes, ¿cuál tiene una mayor afinidad por la hemoglobina produciendo alteraciones en el tejido cerebral, miocárdico y muscular?
1. Monóxido de Carbono.
2. Dióxido de Carbono.
3. Monóxido nítrico.
4. Dióxido de azufre.
5. Ozono.

Respuesta correcta: 1. Monóxido de Carbono.